Clinical trial exclusion criterion:
3. Subject underwent metal graft treatment;

Annotated entities:
- Procedure: "metal graft treatment"
- Device: "metal graft"